Clinical trial exclusion criterion:
Neurological diseases

Annotated entities:
- Condition: "Neurological diseases"